Clinical trial exclusion criterion:
5. Current use (any use in the past 4 weeks, chronic use within 6 past six months) of any investigational drug or of any medications with psychotropic, anti or pro-convulsive action.

Annotated entities:
- Parsing_Error: "5."
- Qualifier: "Current use"
- Temporal: "in the past 4 weeks"
- Qualifier: "any use"
- Qualifier: "chronic use"
- Temporal: "within 6 past six months"
- Temporal: "Current use"
- Drug: "investigational drug"
- Drug: "medications"
- Qualifier: "psychotropic action"
- Qualifier: "pro-convulsive action"